Heart disease

The above is a clinical trial inclusion criterion. Annotated with entity spans:
[Condition: Heart disease]